Clinical trial exclusion criterion:
substance misuse other contraindication to used study drugs no informed consent

Annotated entities:
- Condition: "substance misuse"
- Condition: "contraindication"
- Drug: "study drugs"